Clinical trial inclusion criterion:
Pregnancy, giving birth within the last 90 days, or lactation

Annotated entities:
- Pregnancy_considerations: "Pregnancy, giving birth within the last 90 days, or lactation"